Patients who do not speak English or Spanish

The above is a clinical trial exclusion criterion. Annotated with entity spans:
Patients who do [Negation: not] [Observation: speak English] or Spanish